Clinical trial exclusion criterion:
Unstable vital sign before surgery

Entity relations:
- Has_qualifier("vital sign", "Unstable")
- multi("surgery", "surgery")
- Has_index("before surgery", "surgery")
- Has_temporal("vital sign", "before surgery")